Clinical trial inclusion criterion:
Subject has other medical or surgical conditions which would preclude the potential benefit of surgery, such as congenital abnormalities, immunosuppressive disease, elevation of sedimentation rate unexplained by other diseases, elevation of white blood count (WBC), or marked left shift in the WBC differential count.

Annotated entities:
- Condition: "surgical conditions"
- Condition: "medical conditions"
- Negation: "preclude"
- Procedure: "surgery"
- Condition: "congenital abnormalities"
- Condition: "immunosuppressive disease"
- Value: "elevation"
- Measurement: "sedimentation rate"
- Qualifier: "unexplained by other diseases"
- Value: "elevation"
- Measurement: "white blood count (WBC)"
- Value: "left shift"
- Measurement: "WBC differential count"